List Cdk targets that are dephosphorylated during cytokinesis

Aip1, Ede1 and Inn1 are Cdk targets that are dephosphorylated during cytokinesis.